Clinical trial exclusion criterion:
Contraindication to anticoagulation (heparin or warfarin)

Entity relations:
- AND("Contraindication", "anticoagulation")
- Subsumes("Contraindication", "heparin")
- OR("heparin", "warfarin")